Clinical trial inclusion criterion:
Patients with a diagnosis of osteoarthritis, traumatic arthritis, or avascular necrosis

Entity relations:
- OR("osteoarthritis", "traumatic arthritis", "avascular necrosis")